What is the mechanism of action of vosoritide?

Vosoritide is a biologic analogue of C-type natriuretic peptide, a potent stimulator of endochondral ossification.